What conditions are diagnosed using the scratch collapse test?

The scratch collapse test (SCT) is a clinical examination maneuver that has been reported as a reliable and reproducible test to diagnose carpal tunnel syndrome (CTS) cubital tunnel syndrome and other compressive upper limb neuropathies.